¿Cuál de los siguientes huesos NO contiene senos paranasales?:
1. Esfenoides.
2. Etmoides.
3. Cigomático.
4. Frontal.

Respuesta correcta: 3. Cigomático.